Albumin < 3g/dL at the time of enrollment

The above is a clinical trial exclusion criterion. Annotated with entity spans:
[Measurement: Albumin] [Value: < 3g/dL] at the time of enrollment